Un fármaco es buen candidato para administración transdérmica si:
1. Presenta un semivida larga.
2. No muestra elevada actividad farmacológica.
3. Su coeficiente de reparto oscila entre 10 y 1000.
4. Su peso molecular es mayor de 1000 Da.

Respuesta correcta: 3. Su coeficiente de reparto oscila entre 10 y 1000.